Patients treated with drugs metabolized by the CYP2D6 pathway.

The above is a clinical trial exclusion criterion. Annotated with entity spans:
[Non-query-able: Patients treated with drugs metabolized by the CYP2D6 pathway].